Clinical trial exclusion criterion:
Has aphakia, keratoconus or a highly irregular cornea.

Annotated entities:
- Condition: "aphakia"
- Condition: "keratoconus"
- Condition: "highly irregular cornea"